Clinical trial exclusion criterion:
- Irregular menstrual cycle demanding preparing endometrium with hormones for frozen-thawed embryo

Entity relations:
- AND("Irregular menstrual cycle", "preparing endometrium with hormones for frozen-thawed embryo")